Clinical trial exclusion criterion:
Intranasal steroid use within the last three months

Entity relations:
- Has_temporal("Intranasal steroid use", "within the last three months")
- Has_qualifier("steroid", "Intranasal")
- multi("Intranasal steroid use", "steroid")